下列那一個自體抗體在全身性紅斑性狼瘡（systemic lupus erythematosus, SLE）具有診斷上的意義？
A. 抗 Sm 抗體（anti-Smith antibody）
B. 抗 Scl-70 抗體（anti-Scl-70 antibody）
C. 抗 Jo-1 抗體（anti-Jo-1 antibody）
D. 抗 centromere 抗體（anti-centromere antibody）

正確答案：A. 抗 Sm 抗體（anti-Smith antibody）